Le reacción de Wolff-Kishner es una:
1. Oxidación de carbonilos para dar ácidos.
2. Reducción de carbonilos a alcoholes.
3. Desoxigenación de carbonilos que se realiza en medio ácido.
4. Desoxigenación de carbonilos que se realiza en medio alcalino.
5. Desoxigenación de carbonilos que se realiza en medio neutro.

Respuesta correcta: 4. Desoxigenación de carbonilos que se realiza en medio alcalino.